Clinical trial inclusion criterion:
Has elevated CRP at Screening or evidence of active inflammation in the sacroiliac joints on MRI

Entity relations:
- Has_value("CRP", "elevated")
- Has_temporal("CRP", "at Screening")
- Has_qualifier("inflammation", "sacroiliac joints")
- AND("inflammation", "MRI")
- Has_qualifier("inflammation", "active")
- OR("CRP", "inflammation")